evident dysfunction of cardia,liver and kidney, or pregnant women or women during lactation

The above is a clinical trial exclusion criterion. Annotated with entity spans:
evident [Condition: dysfunction of cardia],liver and kidney, or [Condition: pregnant] women or women during [Condition: lactation]